Clinical trial exclusion criterion:
Non-English speaking parents/patients.

Entity relations:
- OR("Non-English speaking parents", "Non-English speaking patients")